Clinical trial inclusion criterion:
2. Screening tools: Medical Assessment, Medical History and Physical Examination. Medical assessments include: Vital Signs, EKG, oral HIV test, height/weight measurements, urinalysis and blood sample. Tests on the blood sample include CBC, complete metabolic profile, TSH, ESR, STS and HIV (if needed to confirm a positive salivary test for HIV). The following individual laboratory results will independently disqualify individuals: Cholesterol >250 mg/dl, Hemoglobin < 10.5 g/dl, WBC < 2400/microl, LFTs > 3Xnormal, HCG positive, Casual serum glucose > 200 mg/dl, Urine protein > 1+. The MAI will retain discretion to exclude at less extreme values, depending on the clinical presentation. (Serum glucose over 140 mg/dl will be followed up with a fasting serum glucose assessment. Those with fasting glucose below 100 mg/dl may be considered for the protocol. Others will be rejected and referred for work-up.) MAI will make the final judgment on any questionable lab results.

Annotated entities:
- Parsing_Error: "2."
- Procedure: "Medical Assessment"
- Temporal: "Medical History"
- Procedure: "Physical Examination"
- Measurement: "Vital Signs"
- Procedure: "EKG"
- Procedure: "oral HIV test"
- Measurement: "height measurement"
- Measurement: "weight measurement"
- Procedure: "urinalysis"
- Procedure: "blood sample"
- Procedure: "CBC"
- Procedure: "complete metabolic profile"
- Procedure: "TSH"
- Procedure: "ESR"
- Procedure: "STS"
- Procedure: "HIV"
- Measurement: "salivary test for HIV"
- Value: "positive"
- Grammar_Error: "disqualify"
- Measurement: "Cholesterol"
- Value: ">250 mg/dl"
- Measurement: "Hemoglobin"
- Value: "< 10.5 g/dl"
- Measurement: "WBC"
- Value: "< 2400/microl"
- Measurement: "LFTs"
- Value: "> 3Xnormal"
- Measurement: "HCG"
- Value: "positive"
- Measurement: "serum glucose"
- Value: "> 200 mg/dl"
- Measurement: "Urine protein"
- Value: "> 1+"
- Negation: "disqualify"
- Not_a_criteria: "The MAI will retain discretion to exclude at less extreme values, depending on the clinical presentation."
- Subjective_judgement: "The MAI will retain discretion to exclude at less extreme values, depending on the clinical presentation."
- Measurement: "Serum glucose"
- Value: "over 140 mg/dl"
- Procedure: "fasting serum glucose assessment"